Clinical trial exclusion criterion:
serious complications such as uncontrolled diabetes, gastric ulcer or other serious angiocardiopathy determined by the physician

Annotated entities:
- Condition: "diabetes"
- Qualifier: "uncontrolled"
- Condition: "complications"
- Qualifier: "serious"
- Condition: "gastric ulcer"
- Condition: "angiocardiopathy"
- Qualifier: "serious"
- Subjective_judgement: "determined by the physician"